¿Cuál sería la característica diferencial entre un trastorno alimentario y otro que cursa con pérdida significativa de peso y/o patrones alimentarios anómalos?:
1. Los problemas de sueño.
2. El miedo patológico a engordar o la idea sobrevalorada de adelgazar.
3. Las dificultades sociales.
4. La elevada ansiedad.
5. El miedo a la desnutrición.

Respuesta correcta: 2. El miedo patológico a engordar o la idea sobrevalorada de adelgazar.